Willing and able to participate in the study, including willing to go to the study pharmacy to obtain mifepristone

The above is a clinical trial inclusion criterion. Annotated with entity spans:
[Observation: Willing and able to participate in the study], including [Observation: willing to go to the study pharmacy] [Mood: to obtain] [Drug: mifepristone]